Clinical trial exclusion criterion:
Patients having had an ophthalmic surgical procedure within 6 months of the beginning of the study.

Annotated entities:
- Procedure: "ophthalmic surgical procedure"
- Temporal: "within 6 months of the beginning of the study"
- Reference_point: "study"